Hypertriglyceridemic (>400 mg/dl) and hypercholesterolemic (>260 mg/dl) subjects

The above is a clinical trial exclusion criterion. Annotated with entity spans:
[Condition: Hypertriglyceridemic] ([Value: >400 mg/dl]) and [Condition: hypercholesterolemic] ([Value: >260 mg/dl]) subjects